Clinical trial exclusion criterion:
(2) Female infertility due to surgery (no ovaries and / or uterus)

Annotated entities:
- Person: "Female"
- Condition: "infertility"
- Qualifier: "due to surgery"
- Condition: "no ovaries"
- Condition: "no uterus"